Clinical trial inclusion criterion:
No prior ART, including prior administration of pre- and post-exposure prophylaxis in the last 30 days

Entity relations:
- Has_temporal("ART", "prior")
- Has_temporal("administration", "prior")
- Has_temporal("administration", "in the last 30 days")
- Has_negation("ART", "No")
- OR("pre- exposure prophylaxis", "post-exposure prophylaxis")
- OR("ART", "administration")